下列有關第 2 型糖尿病之敘述何者錯誤？
A. 血糖控制愈好，微血管病變（microangiopathy）愈少
B. 血糖控制與大血管病變（macroangiopathy）相關性較少
C. 腎病變若進入 macroalbuminuria 仍然可逆
D. 對初發較年輕病人，HbA1c愈近正常愈好

正確答案：C. 腎病變若進入 macroalbuminuria 仍然可逆